下列何者不是肉毒桿菌食物中毒之特性？
A. 有芽孢可耐熱
B. 侵襲神經系統
C. 致死率為 55-75%
D. 屬格蘭氏陰性

正確答案：D. 屬格蘭氏陰性